Clinical trial exclusion criteria:
Moderate or severe endometriosis.
Hydrosalpinx.
Uterine abnormalities.
Myoma.
Previous uterine surgery.

Annotated entities:
- Condition: "endometriosis"
- Qualifier: "severe"
- Qualifier: "Moderate"
- Condition: "Hydrosalpinx"
- Condition: "Uterine abnormalities"
- Condition: "Myoma"
- Procedure: "uterine surgery"